一名 60 歲婦女於五年前因子宮頸原位癌（carcinoma in situ）切除子宮，半年前因陰道縫合處（vaginal cuff）切片顯示為重度陰道內皮細胞贅生瘤（grade 3 vaginal intraepithelial neoplasia, VAIN 3）而接受雷射汽化治療；之後仍持續出現陰道抹片異常，接下來該怎麼做最適當？
A. 冷凍治療
B. 電燒
C. 外科切除
D. 5-FU 藥膏擦拭

正確答案：C. 外科切除